Clinical trial exclusion criterion:
Contraindication for ketamine infusion

Entity relations:
- multi("ketamine infusion", "ketamine")
- AND("Contraindication", "ketamine infusion")